El amoníaco habitualmente utilizado en el laboratorio:
1. Es un compuesto puro, líquido a temperatura y presión ambientales.
2. Es una disolución de amoníaco gaseoso en agua, muy diluida, pues el amoníaco es muy poco soluble en agua.
3. Es una disolución de amoníaco gaseoso en agua, muy concentrada, pues el amoníaco es muy soluble en agua.
4. Es una disolución de amoníaco gaseoso en etanol, pues el amoníaco gaseoso puro es insoluble en agua.
5. Es una disolución saturada de cloruro amónico en agua.

Respuesta correcta: 3. Es una disolución de amoníaco gaseoso en agua, muy concentrada, pues el amoníaco es muy soluble en agua.